Clinical trial exclusion criterion:
immune deficient state

Annotated entities:
- Condition: "immune deficient state"